Other patients who are not suitable for the study.

The above is a clinical trial exclusion criterion. Annotated with entity spans:
[Non-query-able: Other patients who are not suitable for the study].